What is inhibited by TH1579?

TH1579 inhibits the MTH1 protein, which is the protein that cancer cells rely on to make their DNA.